the child has experienced a severe allergic reaction after previous vaccination, drug or food.

The above is a clinical trial exclusion criterion. Annotated with entity spans:
the [Person: child] has experienced a [Condition: severe allergic reaction] [Temporal: after previous vaccination, drug or food].